Amalia es una niña de 3 años que ha sido intervenida de tetralogía de Fallot. Presentó además una disfunción tímica en el periodo neonatal y una hipocalcemia así como una voz nasal junto a retraso psicomotor. ¿Qué prueba genética considera más adecuada para llegar a su diagnóstico etiológico?
1. Estudio de delección 22q11 (síndrome de DiGeorge o Velo-cardio-facial).
2. Estudio de la expansión del gen FMR1, responsable del síndrome de X fragil.
3. Secuenciación de los genes relacionados con el HRAS (síndrome de Noonan)
4. Estudio genético de síndrome de Williams Beuren.

Respuesta correcta: 1. Estudio de delección 22q11 (síndrome de DiGeorge o Velo-cardio-facial).